① ouabain ② digoxin ③ digitoxin 三者口服生體可用率之大小排列為：
A. ①>②>③
B. ②>③>①
C. ③>②>①
D. ①>③>②

正確答案：C. ③>②>①